Clinical trial inclusion criterion:
patient with mild to severe carotid artery disease

Annotated entities:
- Condition: "carotid artery disease"
- Qualifier: "severe"
- Qualifier: "mild"